Clinical trial exclusion criterion:
Intracranial tumour, vascular malformation or arterial aneurysm;

Entity relations:
- OR("Intracranial tumour", "arterial aneurysm", "vascular malformation")